Clinical trial exclusion criterion:
1. Does not have a documented history of generalized seizures.

Annotated entities:
- Parsing_Error: "1."
- Condition: "generalized seizures"
- Temporal: "history"
- Negation: "not"